Previous therapy of PWS within the last 4 weeks;

The above is a clinical trial exclusion criterion. Annotated with entity spans:
[Temporal: Previous] [Procedure: therapy] of [Condition: PWS] [Temporal: within the last 4 weeks];